Clinical trial exclusion criterion:
Infection at the site of block placement

Entity relations:
- Has_qualifier("Infection", "site of block placement")